Clinical trial exclusion criterion:
8. STEMI or non-STEMI within the past five days

Annotated entities:
- Parsing_Error: "8."
- Condition: "STEMI"
- Condition: "non-STEMI"
- Temporal: "within the past five days"